Clinical trial exclusion criterion:
10. For females, pregnancy or breast-feeding

Annotated entities:
- Parsing_Error: "10."
- Person: "females"
- Condition: "pregnancy"
- Condition: "breast-feeding"